What is the proportion of non canonical splice sites in the human genome?

Between 1% and 2% of human splice sites do not contain the canonical GT-AG dinucleotides